卵巢癌的分期手術，不包括下列何者？
A. 腹膜切片
B. 網膜切除
C. 骨盆及大動脈旁淋巴結切除
D. 子宮根治性切除

正確答案：D. 子宮根治性切除